7. Subject underwent cardiac surgery or cerebrovascular events within the previous six months;

The above is a clinical trial exclusion criterion. Annotated with entity spans:
7. Subject underwent [Procedure: cardiac surgery] or [Condition: cerebrovascular events] [Temporal: within the previous six months];